Clinical trial exclusion criterion:
previous gastric surgery

Entity relations:
- Has_temporal("gastric surgery", "previous")